下列有關於 ketamine 的敘述何者錯誤？
A. 會增加顱內壓，並提高腦部耗氧量
B. 適用於氣喘患者的麻醉
C. 具有止痛效果
D. 可減少心肌耗氧量，故適用於冠狀動脈阻塞病人

正確答案：D. 可減少心肌耗氧量，故適用於冠狀動脈阻塞病人